Clinical trial inclusion criterion:
dilated cardiomyopathy due to valvular heart disease, hypertensive heart disease, history of myocarditis (no active myocardial infection present)

Annotated entities:
- Condition: "dilated cardiomyopathy"
- Condition: "valvular heart disease"
- Condition: "hypertensive heart disease"
- Condition: "myocarditis"
- Temporal: "history"
- Condition: "myocardial infection"
- Negation: "no"
- Temporal: "active"